Clinical trial exclusion criterion:
Known allergy to the study medications (probucol, sirolimus, zotarolimus)

Annotated entities:
- Condition: "allergy"
- Drug: "study medications"
- Drug: "probucol"
- Drug: "sirolimus"
- Drug: "zotarolimus"